Transient relief of symptoms after diagnostic intra-articular injection into the glenohumeral joint

The above is a clinical trial inclusion criterion. Annotated with entity spans:
[Qualifier: Transient] [Condition: relief of symptoms] after diagnostic [Procedure: intra-articular injection] into the [Qualifier: glenohumeral joint]